Children, aged between one and 24 months. classified as (American Society of Anesthesiologists) ASA physical status I or II, undergoing TEE were enrolled in the study.

The above is a clinical trial inclusion criterion. Annotated with entity spans:
[Person: Children], [Person: aged] [Value: between one and 24 months]. classified as ([Measurement: American Society of Anesthesiologists]) [Measurement: ASA physical status] [Value: I or II], undergoing [Procedure: TEE] were enrolled in the study.